Respiratory pathologies, cardiovascular, renal, diabetes

The above is a clinical trial exclusion criterion. Annotated with entity spans:
[Condition: Respiratory pathologies], [Condition: cardiovascular], [Condition: renal], [Condition: diabetes]